患有 Parinaud's syndrome 之腦瘤病人，其病灶常出現於何處？
A. 蝶部（sellar region）
B. 小腦丘腦角（cerebellopontine angle）
C. 矢狀竇旁（parasagittal region）
D. 松果體部（pineal region）

正確答案：D. 松果體部（pineal region）